Clinical trial exclusion criterion:
Current pregnancy (as verified by testing prior to both initial dose administration of citalopram or placebo and prior to magnetic resonance imaging) due to the risk that may be associated with SSRI treatment and magnetic resonance imaging on fetal health

Entity relations:
- Has_temporal("pregnancy", "Current")